taking part in other clinical trials;

The above is a clinical trial exclusion criterion. Annotated with entity spans:
[Competing_trial: taking part in other clinical trials];